Clinical trial inclusion criterion:
Meets Diagnostic and Statistical Manual of Mental Disorders (Versions 4 and 5) criteria for and Major Depressive Disorder.

Annotated entities:
- Measurement: "Diagnostic and Statistical Manual of Mental Disorders criteria"
- Qualifier: "Versions 4"
- Qualifier: "Versions 5"
- Parsing_Error: "and"
- Condition: "Major Depressive Disorder"
- Parsing_Error: "and"